一位 1 歲 6 個月大的女童因為生長遲緩來求診。身體檢查發現她的身高體重均小於第三個百分位。靜脈血分析結果顯示血鈉[Na+]139 mmol/L；血鉀[K+]3.2 mmol/L；血氯[Cl-]109 mmol/L，血中碳酸氫根[HCO3-]19 mmol/L。請算出anion gap？
A. 14.2 mmol/L
B. 11 mmol/L
C. 18 mmol/L
D. 數據不足，無法計算

正確答案：B. 11 mmol/L